Patients with a history of gynecologic malignancy

The above is a clinical trial exclusion criterion. Annotated with entity spans:
Patients with a [Temporal: history] of [Condition: gynecologic malignancy]